Clinical trial inclusion criterion:
The patients underwent neoadjuvant chemotherapy plus surgery or directly modified radical mastectomy or breast-conserving surgery (plus sentinel lymph node biopsy or axillary lymph node dissection) after diagnosis of breast cancer.

Entity relations:
- Has_qualifier("radical mastectomy", "directly modified")
- Has_index("after diagnosis of breast cancer", "diagnosis of breast cancer")
- Has_temporal("sentinel lymph node biopsy", "after diagnosis of breast cancer")
- OR("neoadjuvant chemotherapy", "breast-conserving surgery", "radical mastectomy")
- OR("sentinel lymph node biopsy", "axillary lymph node dissection")
- OR("surgery", "breast-conserving surgery", "radical mastectomy")